Clinical trial exclusion criterion:
Uncontrolled hypertension

Annotated entities:
- Condition: "Uncontrolled hypertension"